Las pomadas oftalmológicas:
1. Pueden contener partículas sólidas pero sólo con un tamaño controlado.
2. No requieren ser estériles.
3. Requieren el ensayo de pirógenos.
4. No pueden ser emulsiones W/O.
5. Siempre sus excipientes deben ser grasos

Respuesta correcta: 1. Pueden contener partículas sólidas pero sólo con un tamaño controlado.